Clinical trial exclusion criterion:
Known hypersensitivity to perflutren (contained in Definity)

Entity relations:
- Subsumes("perflutren", "Definity")
- AND("hypersensitivity", "perflutren")